鏡下描述牛皮癬（psoriasis）有所謂的角化不全（parakeratosis），這是指下列何種表皮角質層的變化而言？
A. 增厚
B. 形成玻璃質樣物質
C. 角質並不成熟，仍有細胞核存在
D. 變薄

正確答案：C. 角質並不成熟，仍有細胞核存在